Clinical trial exclusion criterion:
preterm delivery (<37 weeks of gestation)

Entity relations:
- Has_value("gestation", "<37 weeks")
- Subsumes("preterm delivery", "gestation")